Clinical trial exclusion criterion:
Patients with abnormal TSH concentration

Entity relations:
- Has_value("TSH", "abnormal")